Functional class II, III or IV by the New York Heart Association (NYHA)

The above is a clinical trial inclusion criterion. Annotated with entity spans:
[Value: Functional class II, III or IV] by the [Measurement: New York Heart Association (NYHA)]